下列有關血清素（serotonin）的敘述，何者錯誤？
A. 是一種血管活性的介質（vasoactive mediator）
B. 主要存在於肥大細胞（mast cells）
C. 可存在於胃腸道的神經內分泌細胞（neuroendocrine cells）
D. 對血管的作用與組織胺（histamine）類似

正確答案：B. 主要存在於肥大細胞（mast cells）